contraindications for trial drugs

The above is a clinical trial exclusion criterion. Annotated with entity spans:
[Mood: contraindications for] [Qualifier: trial] [Drug: drugs]